Es un codón de terminación de la traducción:
1. AUG.
2. UAU.
3. UGA.
4. UAC.
5. UGU.

Respuesta correcta: 3. UGA.